10. MRI finding of sacral perineurial cysts, but without any clinical symptoms, included in the negative control group

The above is a clinical trial inclusion criterion. Annotated with entity spans:
10. [Non-query-able: MRI finding of sacral perineurial cysts, but without any clinical symptoms, included in the negative control group]